60歲男性，有高血壓、糖尿病的病史，突發肢體無力、說話困難、站立不穩、複視、頭暈等症狀，神經學檢查顯示右側肢體肌力下降、左側肢體失調、兩眼的眼球無法向外側轉動。病灶最可能在何處？
A. 視丘（thalamus）
B. 中腦（midbrain）
C. 橋腦（pons）
D. 延腦（medulla）

正確答案：C. 橋腦（pons）